Clinical trial exclusion criterion:
Patients with a history of total or unicompartmental reconstruction of the affected joint

Annotated entities:
- Qualifier: "affected joint"
- Procedure: "reconstruction"
- Qualifier: "unicompartmental"
- Qualifier: "total"